The participant has received any of the excluded medications or treatments during.

The above is a clinical trial exclusion criterion. Annotated with entity spans:
[Post-eligibility: The participant has received any of the excluded medications or treatments during.]